Clinical trial inclusion criterion:
Active chronic central serous chorioretinopathy (cCSC);

Entity relations:
- Has_qualifier("central serous chorioretinopathy (cCSC)", "chronic")
- Has_qualifier("central serous chorioretinopathy (cCSC)", "Active")